What are manifestations of the Saint's Triad?

Saint's Triad includes hiatus hernia, gallstones, and diverticulosis coli.